下列有關痲瘋分枝桿菌（Mycobacterium leprae）之敘述，何者有誤？
A. 為一典型之抗酸性（acid-fast）細菌
B. 達不瘋（dapsone）為治療其感染之第一線藥物
C. 其診斷方法以細菌培養為主
D. 疾病之表徵是由於宿主對感染體產生免疫反應所造成

正確答案：C. 其診斷方法以細菌培養為主